Clinical trial exclusion criterion:
Cyanotic heart disease (congenital or acquired)

Entity relations:
- Has_qualifier("Cyanotic heart disease", "congenital")
- OR("congenital", "acquired")